Clinical trial exclusion criterion:
Women with history of breast cancer or breast surgery in the same quadrant

Annotated entities:
- Person: "Women"
- Condition: "breast cancer"
- Condition: "breast surgery"
- Qualifier: "same quadrant"